Clinical trial exclusion criterion:
Valvular Heart Disease including those with prosthetic valve, mitral stenosis (moderate to severe) or valve repair.

Entity relations:
- Subsumes("mitral stenosis", "moderate")
- OR("moderate", "severe")
- OR("Valvular Heart Disease", "valve repair", "prosthetic valve", "mitral stenosis")